目前上市的子宮頸癌疫苗，主要是以人類乳突病毒（HPV）的那一種蛋白質為抗原做為免疫防治的基礎？
A. E5
B. E6
C. E7
D. L1

正確答案：D. L1